10. Current smoker.

The above is a clinical trial exclusion criterion. Annotated with entity spans:
10. [Temporal: Current] [Observation: smoker].